Coronary-artery bypass graft, percutaneous intervention (e.g. cardiac, cerebrovascular, aortic; diagnostic catheters are allowed) or major surgery, including thoracic and cardiac surgery, within the last 3 months.

The above is a clinical trial exclusion criterion. Annotated with entity spans:
[Procedure: Coronary-artery bypass graft], [Procedure: percutaneous intervention] (e.g. cardiac, cerebrovascular, aortic; diagnostic catheters are allowed) or [Procedure: major surgery], including [Procedure: thoracic] and [Procedure: cardiac surgery], [Temporal: within the last 3 months].